Clinical trial exclusion criterion:
7. St.Jonh's Wort

Annotated entities:
- Parsing_Error: "7."
- Drug: "St.Jonh's Wort"